E. coli 修護 DNA 複製產生之錯配（mismatch），須靠辨識母股（parental strand）上的何種修飾？
A. adenine 甲基化
B. guanine 甲基化
C. cytosine 甲基化
D. thymine 甲基化

正確答案：A. adenine 甲基化